Age: 10-18 years.

The above is a clinical trial inclusion criterion. Annotated with entity spans:
[Person: Age]: [Value: 10-18 years].